Pressure sores where harness would be applied

The above is a clinical trial exclusion criterion. Annotated with entity spans:
[Condition: Pressure sores] where [Device: harness] would be applied